侵襲性小葉癌（invasive lobular carcinoma）主要的分子特徵為何？
A. 不表現E-cadherin
B. Her2基因增幅（amplification）
C. BRCA1基因突變
D. 上皮生長因子受體（epidermal growth factor receptor）過度表現

正確答案：A. 不表現E-cadherin